How long, in kb (kilobases),  is a "Long interspersed nuclear element"?

The retrotransposon known as long interspersed nuclear element-1 (L1) is 6-7 kb long,